Clinical trial inclusion criterion:
Ability to firmly press trial treatment at TBS until 4 minutes after randomisation

Annotated entities:
- Post-eligibility: "Ability to firmly press trial treatment at TBS until 4 minutes after randomisation"